CKD patients classified as Stage 3 and 4 of National Kidney Foundation Classification with estimated glomerular filtration rate (GFR) between 15 and 59 mL/min/1.73 m2 according to the Modification of Diet in Renal Disease (MDRD) formula based on serum creatinine, age, gender, and race.

The above is a clinical trial inclusion criterion. Annotated with entity spans:
[Condition: CKD] patients classified as [Value: Stage 3] and 4 of [Measurement: National Kidney Foundation Classification] with [Measurement: estimated glomerular filtration rate (GFR)] [Value: between 15 and 59 mL/min/1.73 m2] according to the [Qualifier: Modification of Diet in Renal Disease (MDRD) formula] based on serum creatinine, age, gender, and race.